A diagnosis of VTE in outpatient clinic or as discharge diagnosis after hospitalization.

The above is a clinical trial inclusion criterion. Annotated with entity spans:
A diagnosis of [Condition: VTE] in [Visit: outpatient clinic] or as [Qualifier: discharge diagnosis] [Temporal: after hospitalization].